Una clasificación de detectores de cromatografía de gases que comúnmente se encuentra en la bibliografía los divide en detectores sensibles a la concentración o al flujo másico, destructivos y no destructivos, integrales o diferenciales y universales o selectivos. Según esta clasificación:
1. El detector de conductividad térmica es un detector selectivo.
2. El detector de ionización de llama es un detector de flujo másico.
3. El detector de conductividad térmica es un detector universal que responde a la masa de analito.
4. El detector de fósforo y nitrógeno (NPD) es un detector diferencial universal.

Respuesta correcta: 2. El detector de ionización de llama es un detector de flujo másico.